下列有關情感性精神分裂症（schizoaffective disorder）的敘述，何者錯誤？
A. 此症之預後與精神分裂症相同
B. 此症患者的家屬比一般人更易得到精神分裂症
C. 相較於主要症狀為 schizophrenic symptoms，主要症狀為 affective symptoms 的患者其預後較佳
D. 此症之診斷，必須有一段時間同時存在 schizophrenic symptoms 與 affective symptoms

正確答案：A. 此症之預後與精神分裂症相同